1) age 50-70

The above is a clinical trial inclusion criterion. Annotated with entity spans:
[Parsing_Error: 1)] [Person: age] [Value: 50-70]